Chronic pain more than 3 months

The above is a clinical trial exclusion criterion. Annotated with entity spans:
[Condition: Chronic pain] [Temporal: more than 3 months]